Respecto a las características de personalidad, una de las siguientes alternativas es cierta:
1. El estilo de personalidad conocido como Tipo A aumenta la probabilidad de enfermedades digestivas.
2. El estilo de personalidad conocido como Tipo A aumenta la probabilidad de enfermedades cardiovasculares.
3. El estilo de personalidad conocido como Tipo B aumenta la probabilidad de enfermedades digestivas.
4. El estilo de personalidad conocido como Tipo B aumenta la probabilidad de enfermedades cardiovasculares.

Respuesta correcta: 2. El estilo de personalidad conocido como Tipo A aumenta la probabilidad de enfermedades cardiovasculares.